下列有關主動脈瓣狹窄之敘述，何者錯誤？
A. 二瓣性主動脈瓣（bicuspid aortic valve）是一種最常見的先天性瓣膜異常，易導致主動瓣狹窄
B. 因造成左心室血流輸出阻礙，疾病早期，左心室會擴大以代償輸出量之不足，但此時病人無明顯症狀
C. 當病程進展到開始出現臨床心臟衰竭症狀時，若無妥善治療，平均病人存活時間僅剩2年以下
D. 因器材技術進步，經導管主動脈置換術（TAVR），在外科開刀風險較高的病人族群的治療結果已與傳統瓣膜置換手術相近

正確答案：B. 因造成左心室血流輸出阻礙，疾病早期，左心室會擴大以代償輸出量之不足，但此時病人無明顯症狀